Clinical trial exclusion criterion:
History of organic brain disease

Annotated entities:
- Condition: "organic brain disease"
- Temporal: "History of"